更年期後骨質疏鬆最不可能的原因為何？
A. 動情激素減少
B. 鈣質減少
C. 副甲狀激素分泌不正常
D. 黃體素增加

正確答案：D. 黃體素增加